40 歲男性，過去有長期高血壓及低血鉀的病史，並未接受藥物治療。最近一周來，因為反覆性的頭痛、心悸、全身無力而入院檢查。理學檢查上除了高血壓（190/100 mmHg）外，無其他異常發現。血液檢查顯示有低血鉀，血中aldosterone上升，renin activity下降。24 小時尿液檢查，鉀排出明顯增加。腹部電腦斷層顯示右側腎上腺有一 1.3 公分腫瘤，而核醫I131-NP59 scan顯示雙側腎上腺對稱性增加 顯影。對於這個病患，下列何種檢查較能區分aldosterone-producing adenoma或是bilateral adrenal hyperplasia造成的idiopathic hyperaldosteronism？
A. bilateral adrenal vein sampling
B. 24hr urine VMA, catecholamine
C. 24hr urine potassium
D. abdominal CT scan

正確答案：A. bilateral adrenal vein sampling